Clinical trial inclusion criterion:
Planned gynecological lower abdomen surgery with epidural pain treatment

Entity relations:
- AND("gynecological lower abdomen surgery", "epidural pain treatment")
- Has_mood("gynecological lower abdomen surgery", "Planned")